下列何者不是伺機性黴菌感染疾病之重要 predisposing factor？
A. 服用抗微生物藥物
B. 惡性腫瘤
C. 外科手術或燒傷
D. 男女性別

正確答案：D. 男女性別